Clinical trial exclusion criteria:
Age < 20 or > 35 years.
Body mass index (BMI) < 18.5 kg/m2 or > 25 kg/m2.
Presence of any infertility factor other than anovulation/oligoovulation.
Previous history of ovarian surgery or surgical removal of one ovary.
Previous exposure to cytotoxic drugs or pelvic irradiation.
Metabolic or hormonal abnormalities.

Annotated entities:
- Person: "Age"
- Value: "< 20"
- Value: "> 35 years"
- Measurement: "Body mass index"
- Measurement: "BMI"
- Value: "< 18.5 kg/m2"
- Value: "> 25 kg/m2"
- Condition: "infertility factor"
- Negation: "other than"
- Condition: "anovulation"
- Condition: "oligoovulation"
- Procedure: "ovarian surgery"
- Procedure: "surgical removal"
- Qualifier: "ovary"
- Multiplier: "one"
- Drug: "cytotoxic drugs"
- Procedure: "pelvic irradiation"
- Condition: "hormonal abnormalities"
- Condition: "Metabolic abnormalities"